Use of smoking cessation medications or interventions in last 30 days

The above is a clinical trial exclusion criterion. Annotated with entity spans:
Use of [Procedure: smoking cessation] [Procedure: medications] or [Procedure: interventions] [Temporal: in last 30 days]